下列那一項構造，與橫膈（diaphragm）的組成無關？
A. 橫中隔（septum transversum）
B. 胸腹膜（pleuroperitoneal membrane）
C. 食道背側繫膜（dorsal mesentery of esophagus）
D. 胸心包膜（pleuropericardial membrane）

正確答案：D. 胸心包膜（pleuropericardial membrane）